Las enzimas de restricción hidrolizan enlaces:
1. Fosfodiéster.
2. Glucosídicos.
3. Peptídicos.
4. Iónicos.
5. Por puentes de hidrógeno.

Respuesta correcta: 1. Fosfodiéster.